Clinical trial exclusion criterion:
Active malignancy or infection

Entity relations:
- Has_qualifier("malignancy", "Active")
- OR("malignancy", "infection")